Non- English speakers

The above is a clinical trial exclusion criterion. Annotated with entity spans:
[Observation: Non- English speakers]